Acude a la consulta un enfermo diagnosticado de esclerosis múltiple hace 6 meses. ¿Qué sintomatología NO esperaría encontrar?
1. Diplopia.
2. Alteraciones auditivas.
3. Alteraciones urinarias.
4. Depresión.

Respuesta correcta: 2. Alteraciones auditivas.